一位70歲男性膀胱癌病人，接受經尿道膀胱腫瘤切除術（TUR-BT），術中發現只有1個約1公分之腫瘤，病理切片是移形細胞癌（transitional cell carcinoma）grade I，期別是Ta，下列手術後處置何者正確？
A. 需要接受膀胱內卡介苗（BCG）灌注輔助治療
B. 需要接受膀胱內化學藥物灌注輔助治療
C. 不需要接受任何膀胱內化學藥物或 BCG 灌注輔助治療
D. 需要接受放射輔助治療

正確答案：C. 不需要接受任何膀胱內化學藥物或 BCG 灌注輔助治療